一位病人因運動性氣促、疲倦而住院，身體檢查發現頸靜脈腫脹，肺與心臟檢查正常，肝臟有三指幅腫大且下肢水腫，脈搏有奇脈（paradoxical pulse）；胸部 X 光檢查顯示心臟正常，肺野清晰，則最可能的診斷是：
A. 肝臟腫瘤
B. 腎臟衰竭
C. 窄縮性心包囊炎（constrictive pericarditis）
D. 低白蛋白血症（hypoalbuminemia）

正確答案：C. 窄縮性心包囊炎（constrictive pericarditis）